Clinical trial inclusion criteria:
Men and women patients, with age ranging 40-80.
Suspected coronary artery disease who are supposed to undergo invasive coronary angiography with appropriate clinical indications
Patients who are willing to sign the informed consent form

Annotated entities:
- Person: "women"
- Person: "Men"
- Person: "age"
- Value: "ranging 40-80"
- Condition: "coronary artery disease"
- Mood: "Suspected"
- Procedure: "invasive coronary angiography"
- Mood: "supposed to undergo"
- Post-eligibility: "Patients who are willing to sign the informed consent form"